Clinical trial exclusion criterion:
Females who are pregnant or nursing.

Entity relations:
- OR("pregnant", "nursing")